劇烈運動時，體循環不會發生下列何種現象？
A. 紅血球內的重碳酸氫根離子（HCO3-）進入血漿
B. 大部分溶解態的二氧化碳進入紅血球
C. 碳酸（H2CO3）於紅血球中被合成及解離
D. 血球內的氯離子進入血漿

正確答案：D. 血球內的氯離子進入血漿